Pregnant women or nursing mothers who are not willing to stop breastfeeding.

The above is a clinical trial exclusion criterion. Annotated with entity spans:
[Pregnancy_considerations: Pregnant women or nursing mothers who are not willing to stop breastfeeding].